下列何者是心臟病患參加運動訓練的禁忌症？
A. 服用乙型阻斷劑之降血壓藥物
B. 嚴重主動脈狹窄
C. 第一級房室傳導障礙
D. 曾接受心臟移植的病患

正確答案：B. 嚴重主動脈狹窄